Una de las características de la experiencia del delirio primario es:
1. Su mayor modificabilidad, comparada con el secundario.
2. La preocupación obsesiva primaria del paciente por controlar la realidad.
3. Que no tiene su origen en una experiencia anómala previa.
4. Que no se mantiene con intensa convicción.
5. Que es plausible.

Respuesta correcta: 3. Que no tiene su origen en una experiencia anómala previa.